Clinical trial exclusion criterion:
bone-specific pretreatment (DMAB, TPTD, strontium ranelate, SERMs) Bisphosphonate treatment is allowed

Entity relations:
- Subsumes("bone-specific pretreatment", "DMAB")
- OR("DMAB", "strontium ranelate", "TPTD", "SERMs")